Clinical trial exclusion criterion:
Substantial alcohol use

Annotated entities:
- Condition: "Substantial alcohol use"